Clinical trial inclusion criterion:
. Inclusion criteria are American Society of Anesthesiologists (ASA) physical status I-III, age between 18 and 70 years and body mass index (BMI) between 20 and 35 kg/m2.

Annotated entities:
- Measurement: "American Society of Anesthesiologists physical status"
- Measurement: "ASA"
- Value: "I-III"
- Person: "age"
- Value: "between 18 and 70 years"
- Measurement: "body mass index"
- Measurement: "BMI"
- Value: "between 20 and 35 kg/m2"